當小客車司機因追撞大貨車，於急救時出現大量血氣胸，必須緊急給予胸管引流治療。有關胸管置放之位置，下列敘述何者正確？
A. 第四或五肋間，腋中線（4th or 5th intercostal space, mid-axillary line）
B. 第二肋間，鎖骨中線（2nd intercostal space, mid-clavicular line）
C. 第六或七肋間，腋中線（6th or 7th intercostal space, mid-axillary line）
D. 視病患之情況而定

正確答案：A. 第四或五肋間，腋中線（4th or 5th intercostal space, mid-axillary line）